Any carotid stenting or endarterectomy

The above is a clinical trial exclusion criterion. Annotated with entity spans:
Any [Device: carotid stenting] or [Procedure: endarterectomy]